El síndrome de secreción inadecuada de hormona antidiurética (SIADH) se caracteriza por:
1. Hiponatremia.
2. Hipovolemia.
3. Concentraciones de ion sodio en orina inferiores a 20 mmol/L.
4. Osmolalidad en orina inferior a la osmolalidad en suero.
5. Concentraciones elevadas de ion calcio.

Respuesta correcta: 1. Hiponatremia.